Clinical trial inclusion criterion:
Aged 18 or over (up to the age of 35 which is the limit for the early intervention service)

Entity relations:
- Has_value("Aged", "18 or over")
- Has_value("Aged", "up to the age of 35")